35歲女性，月經不規則已有兩年，最近八個月則完全無月經。身體檢查發現乳房有乳汁分泌。腦垂腺核磁共振檢查，發現腦垂腺前葉有一直徑1.5公分的腫瘤。則下列何者錯誤？
A. 若不治療，長期會造成骨質疏鬆
B. 腫瘤往上壓迫會造成視野缺損
C. 可使用sulpiride治療
D. 手術成功率與腫瘤大小呈負相關

正確答案：C. 可使用sulpiride治療